Clinical trial inclusion criteria:
Adult Patients with Overt Hepatic Encephalopathy.

Annotated entities:
- Person: "Adult"
- Condition: "Overt Hepatic Encephalopathy"